Clinical trial exclusion criterion:
Patients with acute gastrointestinal bleeding

Annotated entities:
- Condition: "gastrointestinal bleeding"
- Qualifier: "acute"